下列何種截肢最常使用內側開窗戶式套筒（medial opening socket）？
A. 賽姆氏（Syme's amputation）
B. 脛骨（transtibial amputation）
C. 股骨（transfemoral amputation）
D. 賽柏氏（Chopart amputation）

正確答案：A. 賽姆氏（Syme's amputation）